Clinical trial exclusion criterion:
Non-reassuring fetal assessment at the time of recruitment

Entity relations:
- Has_value("fetal assessment", "Non-reassuring")
- Has_temporal("fetal assessment", "at the time of recruitment")